顳頜關節（temporomandibular joint）手術後，耳下腺（parotid gland）分泌功能降低，下列何者最可能受損？
A. 顏面神經（facial nerve）
B. 耳顳神經（auriculotemporal nerve）
C. 舌神經（lingual nerve）
D. 下齒槽神經（inferior alveolar nerve）

正確答案：B. 耳顳神經（auriculotemporal nerve）